Adults 18-65 years, who are diagnosed with functional neurologic symptom or conversion disorder. If diagnosis of seizure type then video EEG with diagnosis confirmed by board-certified neurologist with subspecialty training in epilepsy and clinical neurophysiology using the criteria of the International Classification of the Epilepsies is required. If diagnosis of motor type, documented and clinically established levels of diagnostic certainty (Williams,1995) confirmed by 2 neurologists is required.

The above is a clinical trial inclusion criterion. Annotated with entity spans:
[Person: Adults] [Value: 18-65 years], who are diagnosed with [Condition: functional neurologic symptom] or [Condition: conversion disorder]. If diagnosis of [Condition: seizure type] then [Procedure: video EEG] with diagnosis confirmed by board-certified neurologist with subspecialty training in epilepsy and clinical neurophysiology using the [Measurement: criteria of the International Classification of the Epilepsies] is required. If diagnosis of [Condition: motor type], [Non-query-able: documented and clinically established levels of diagnostic certainty (Williams,1995) confirmed by 2 neurologists is required.]